Clinical trial exclusion criterion:
Severe infectious disease, example (eg) Human Immunodeficiency Virus positive or active tuberculosis.

Annotated entities:
- Condition: "infectious disease"
- Qualifier: "Severe"
- Condition: "Human Immunodeficiency Virus positive"
- Condition: "tuberculosis"
- Qualifier: "active"